Clinical trial exclusion criterion:
Major surgery, biopsy of a parenchymal organ, or significant trauma within the past 2 months (this includes any trauma associated with the current myocardial infarction)

Entity relations:
- Has_qualifier("trauma", "significant")
- Has_qualifier("biopsy", "parenchymal organ")
- Has_temporal("Major surgery", "past 2 months")
- Subsumes("trauma", "myocardial infarction")
- OR("Major surgery", "biopsy", "trauma")